Prior medical or surgical management of this gestation

The above is a clinical trial exclusion criterion. Annotated with entity spans:
Prior [Procedure: medical] or [Procedure: surgical management] of this [Condition: gestation]